2. Screening tool: Edinburgh Handedness Inventory.

The above is a clinical trial inclusion criterion. Annotated with entity spans:
[Parsing_Error: 2.] [Not_a_criteria: Screening tool: Edinburgh Handedness Inventory.]